一位 30 歲的男性，參加 3 月之臺北馬拉松賽，當天天氣晴朗，氣溫 20~22℃，濕度 90%，在快抵達終點時，被人發現意識不清倒在地上。你在現場做醫療服務，發現病患昏迷指數 GCS（Glasgow coma scale）=E2V3M5，身上有出汗，此時病患血壓 100/50 mmHg，心跳 145/分，呼吸 26/分，耳溫 41℃。 下列敘述何者正確？
A. 當天氣溫只有 22℃，應不會發生中暑（heat stroke）
B. 他身上有出汗，應不會是中暑
C. 應先當作中暑治療，快速降溫
D. 應立即將他送到醫院做電腦斷層檢查，以排除腦中風診斷

正確答案：C. 應先當作中暑治療，快速降溫